有關苯二氮平類（benzodiazepines）之鎮靜安眠藥戒斷症狀敘述，下列何者正確？
A. 戒斷產生之幻覺首選治療藥物為抗精神病藥物（antipsychotics）
B. 治療失眠必要時可合併有鎮靜效果之抗憂鬱劑來治療
C. 避免戒斷癲癇應改投以短效型藥物如 lorazepam
D. 若有住院則可立即停止鎮靜安眠藥

正確答案：B. 治療失眠必要時可合併有鎮靜效果之抗憂鬱劑來治療